Clinical trial inclusion criterion:
A pre-bronchodilatory forced expiratory flow in 1 second (FEV1) at Visit 1 (Screening) >=80% predicted. There should be no Short acting beta-agonist (SABA) use within 4 hours of this measurement.

Entity relations:
- Has_value("forced expiratory flow in 1 second (FEV1)", ">=80% predicted")
- Has_temporal("forced expiratory flow in 1 second (FEV1)", "at Visit 1 (Screening)")
- Has_qualifier("forced expiratory flow in 1 second (FEV1)", "pre-bronchodilatory")
- Has_index("within 4 hours of this measurement", "this measurement")
- Has_temporal("Short acting beta-agonist (SABA)", "within 4 hours of this measurement")
- Has_negation("Short acting beta-agonist (SABA)", "no")
- Has_index("at Visit 1 (Screening)", "Visit 1 (Screening)")